Clinical trial exclusion criterion:
13. Treatment with systemic corticosteroids (>15 mg/day), or current immunosuppressive agents

Annotated entities:
- Parsing_Error: "13."
- Drug: "systemic corticosteroids"
- Value: ">15 mg/day"
- Procedure: "Treatment"
- Drug: "immunosuppressive agents"
- Temporal: "current"